一位 3 歲女童發燒一天後，由前胸與頸部開始出現極癢的水泡，這些水泡逐漸擴散到四肢，看診醫師給予止癢藥與 aspirin 30 mg/kg/day，qid 治療。一天後發燒仍然持續，四肢出現大片紅疹，並有草莓舌現象，於是帶給另一位醫師診治。該醫師發現病人有草莓舌，水泡周圍明顯紅腫化膿，於是給予 acetaminophen 40 mg/kg/day，qid 與口服 cephalexin 治療。治療一天後退燒，紅疹也慢慢消退，但隔天小孩開始出現嚴重嘔吐、意識不清，於是緊急被帶到急診處，初步檢查顯示白血球 9200/mm3 ，blood sugar 12 mg/dL，bilirubin total/direct：0.4/0.1 mg/dL，alanine aminotransferase（ALT，GPT） 220 U/L，prothrombin time 40 秒（control：14 秒），腦脊髓液白血球 3/mm3，均為淋巴球。送入加護病房以後病人一直沒有發燒，經支持性治療七天以後痊癒出院，出院時醫師發現病人的手指與腳趾有脫皮現象。根據這位女童的病情，最可能的診斷為：
A. 水痘併發金黃色葡萄球菌或 A 群鏈球菌感染，後來發生雷氏症候群（Reye syndrome）
B. 水痘併發川崎病（Kawasaki disease）並有中樞神經系統侵犯現象
C. 金黃色葡萄球菌或 A 群鏈球菌敗血症併發腦膜炎
D. 川崎病後來出現 acetaminophen 中毒

正確答案：A. 水痘併發金黃色葡萄球菌或 A 群鏈球菌感染，後來發生雷氏症候群（Reye syndrome）